Clinical trial exclusion criterion:
Unstable asthma or which may have required urgent care, hospitalization or intubation within the last 2 years, or which requires use of oral or intravenous corticosteroid.

Entity relations:
- Has_temporal("required urgent care", "within the last 2 years")
- Has_qualifier("Unstable asthma", "required urgent care")
- Has_temporal("hospitalization", "within the last 2 years")
- Has_temporal("urgent care", "within the last 2 years")
- Has_temporal("intubation", "within the last 2 years")
- AND("Unstable asthma", "hospitalization")
- AND("Unstable asthma", "urgent care")
- AND("Unstable asthma", "intubation")
- OR("required urgent care", "required hospitalization", "required intubation")
- OR("requires use of oral corticosteroid", "requires use of intravenous corticosteroid")
- OR("required urgent care", "oral corticosteroid")
- OR("hospitalization", "oral corticosteroid")
- OR("urgent care", "oral corticosteroid")
- OR("intubation", "oral corticosteroid")